History of Crohn's Disease, Irritable Bowel Syndrome, radiation therapy in the rectoanal region

The above is a clinical trial exclusion criterion. Annotated with entity spans:
[Temporal: History] of [Condition: Crohn's Disease], [Condition: Irritable Bowel Syndrome], [Procedure: radiation therapy] in the [Qualifier: rectoanal region]